Myelodysplastic syndrome (MDS) or myelofibrosis;

The above is a clinical trial exclusion criterion. Annotated with entity spans:
[Condition: Myelodysplastic syndrome (MDS)] or [Condition: myelofibrosis];